Clinical trial exclusion criterion:
Known hypersensitivity or contraindication to any of the following medications: Heparin, aspirin, clopidogrel, sirolimus, siptagliptin and statin

Entity relations:
- AND("hypersensitivity", "Heparin")
- OR("hypersensitivity", "contraindication")
- OR("Heparin", "siptagliptin", "sirolimus", "clopidogrel", "aspirin", "statin")